Clinical trial inclusion criterion:
Known allergies against ingredients of the investigational products

Entity relations:
- AND("allergies", "ingredients of the investigational products")